5. Patients on standard treatment of chronic heart failure at the target dose or maximum tolerance dose for over 1 month ,or unchanged dose in last 1 month;

The above is a clinical trial inclusion criterion. Annotated with entity spans:
5. Patients on standard [Procedure: treatment of chronic heart failure] at the [Observation: target dose] or [Observation: maximum tolerance dose] [Temporal: for over 1 month] ,or [Observation: unchanged dose] [Temporal: in last 1 month];